Clinical trial exclusion criterion:
Significant, non-reversible active pulmonary disease (e.g. cystic fibrosis, bronchiectasis, tuberculosis).

Annotated entities:
- Condition: "pulmonary disease"
- Undefined_semantics: "pulmonary disease"
- Qualifier: "Significant"
- Subjective_judgement: "Significant"
- Qualifier: "non-reversible"
- Temporal: "active"
- Condition: "cystic fibrosis"
- Condition: "bronchiectasis"
- Condition: "tuberculosis"